Clinical trial exclusion criterion:
Any antibiotic intake 7 days prior to blood collection.

Entity relations:
- Has_index("7 days prior to blood collection", "blood collection")
- Has_temporal("antibiotic", "7 days prior to blood collection")